一位 35 歲女性患者，二年來大部分時間持續出現心情低落、頭暈、頭脹、注意力不集中、記憶力下降、入睡困難等症狀，但患者仍能維持一般工作及角色功能，本案例最可能之診斷為何？
A. 重鬱症（major depression）
B. 適應性疾患（adjustment disorder）
C. 低落性情感疾患（dysthymic disorder）
D. 焦慮症（anxiety disorder）

正確答案：C. 低落性情感疾患（dysthymic disorder）